Other investigational procedure <=30 days before study entry.

The above is a clinical trial exclusion criterion. Annotated with entity spans:
[Qualifier: Other] [Procedure: investigational procedure] [Temporal: <=30 days before study entry].